Conditions or pathologies supposed to alter gastric emptying times (Thyroid dysfunction, chronic renal failure, Parkinson's disease, scleroderma, amyloidosis, any gastrointestinal disease, any not cured malignancy, and any advanced psychiatric or neurological disease).

The above is a clinical trial exclusion criterion. Annotated with entity spans:
[Condition: Conditions] or [Condition: pathologies supposed to alter gastric emptying times] ([Condition: Thyroid dysfunction], [Condition: chronic renal failure], [Condition: Parkinson's disease], [Condition: scleroderma], [Condition: amyloidosis], any [Condition: gastrointestinal disease], any not cured [Condition: malignancy], and any [Qualifier: advanced] [Condition: psychiatric] or [Condition: neurological disease]).